Clinical trial inclusion criterion:
Age between 18 and 49 years old;

Annotated entities:
- Person: "Age"
- Value: "between 18 and 49 years old"